依診斷原則，一案例從事動物標本病理化驗工作（暴露福馬林、酒精、二甲苯）已 2 年，因過去 5 年經常頭痛而經電腦斷層診斷是腦瘤，若其要求出具疾病與職業相關診斷證明，下列敘述何者最正確？
A. 合理，有因果相關
B. 合理，因有醫學文獻報告
C. 不合理，相同工作的同事沒有人得到腦瘤
D. 不合理，不符合時序性

正確答案：D. 不合理，不符合時序性